遺傳密碼（codon）與反密碼（anticodon）的相互作用是經由那一種化學鍵相結合？
A. 氫鍵（hydrogen bond）
B. 離子鍵（ionic bond）
C. 肽鍵（peptide bond）
D. 縮醛鍵（acetal bond）

正確答案：A. 氫鍵（hydrogen bond）